Clinical trial exclusion criterion:
Receiving nasal or facial surgery recently;

Annotated entities:
- Procedure: "facial surgery"
- Procedure: "nasal surgery"